Clinical trial exclusion criteria:
Patients with known or suspected heparin induced thrombocytopenia prior to consent
Patients with hepatic failure defined as coagulopathy with elevated transaminases more than three times normal values
Patients with plan to decannulate from ECMO within 48 hours
Known or suspected pregnant women
Previous enrollment in this study
Primary language spoken that is not English or Spanish

Annotated entities:
- Drug: "heparin"
- Condition: "thrombocytopenia"
- Temporal: "prior to consent"
- Reference_point: "consent"
- Qualifier: "heparin induced"
- Mood: "suspected"
- Mood: "known"
- Condition: "hepatic failure"
- Condition: "coagulopathy"
- Measurement: "transaminases"
- Value: "elevated more than three times normal values"
- Temporal: "within 48 hours"
- Procedure: "decannulate from ECMO"
- Condition: "pregnant"
- Person: "women"
- Mood: "suspected"
- Mood: "Known"
- Competing_trial: "Previous enrollment in this study"
- Non-query-able: "Primary language spoken that is not English or Spanish"